一位13歲女學生前來婦產科看診，要求醫師開給她避孕藥，這位女學生表示已經有性行為，且是出於自願， 並要求醫師絕對不能告訴其家人或學校，醫師應該如何處理？
A. 給予性衛教與輔導即可
B. 報告父母／監護人或社會局
C. 報告學校當局
D. 尊重病人的隱私權不予揭露

正確答案：B. 報告父母／監護人或社會局